Heavy tobacco smokers

The above is a clinical trial exclusion criterion. Annotated with entity spans:
[Condition: Heavy tobacco smokers]